Patient contact lens refraction should fit within the available parameters of the study lenses.

The above is a clinical trial inclusion criterion. Annotated with entity spans:
[Non-query-able: Patient contact lens refraction should fit within the available parameters of the study lenses.]